最常見的單一顱骨縫合過早（single-suture craniosynostosis）是何種？
A. 冠狀縫（coronal）
B. 人	縫（lambdoid）
C. 矢狀縫（sagittal）
D. 蝶顳縫（sphenozygomatic）

正確答案：C. 矢狀縫（sagittal）